Which method has been developed for detection of ATAC-seq or ChIP-seq signals with DNA methylation?

EpiMethyl tag is a technology that combines ATAC-seq or ChIP-seq (M-ATAC or M-ChIP) with bisulfite conversion, to simultaneously examine accessibility/TF binding and methylation on the same DNA.